Willing to be hospitalized on a research unit for 24 hours, longer if detoxification is needed.

The above is a clinical trial inclusion criterion. Annotated with entity spans:
[Post-eligibility: Willing to be hospitalized on a research unit for 24 hours, longer if detoxification is needed].